Clinical trial inclusion criterion:
Eligible for percutaneous coronary intervention with Absorb Bioresorbable Vascular Scaffold or Everolimus Eluting Stent

Entity relations:
- Has_mood("percutaneous coronary intervention", "Eligible for")
- AND("percutaneous coronary intervention", "Absorb Bioresorbable Vascular Scaffold")
- OR("Absorb Bioresorbable Vascular Scaffold", "Everolimus Eluting Stent")